Clinical trial inclusion criterion:
Patients presenting for elective posterior spinal fusion surgery (lower thoracic, lumbar, sacral)

Annotated entities:
- Procedure: "posterior spinal fusion surgery"
- Qualifier: "elective"
- Qualifier: "lower thoracic"
- Qualifier: "lumbar"
- Qualifier: "sacral"